Clinical trial exclusion criterion:
19. Active hepatitis B or C or other active liver disease

Annotated entities:
- Condition: "hepatitis B"
- Condition: "hepatitis C"
- Temporal: "Active"
- Condition: "liver disease"
- Temporal: "active"